Clinical trial exclusion criterion:
Painful regular uterine contraction and/or preterm labor

Entity relations:
- OR("Painful regular uterine contraction", "preterm labor")